Clinical trial inclusion criterion:
resection must have been histologically complete laterally with regard to the microinvasive cancer, that is to say with a clear margin of safety (margin may be high-grade dysplasia provided that the latter has not macroscopic translation),

Entity relations:
- Has_qualifier("resection", "complete laterally")
- AND("complete laterally", "microinvasive cancer")